尿液中的 Vanillylmandelic acid，可用來診斷何種疾病？
A. Wilms' tumor
B. Hepatoblastoma
C. Seminoma
D. Neuroblastoma

正確答案：D. Neuroblastoma